Clinical trial exclusion criterion:
Abnormal hepatic function (liver function test > twice the normal range), abnormal renal function (creatinine > 1.1 mg/dl), fasting plasma glucose in the diabetic range (>/= 126 mg/dl), or blood pressure > 140/90 mmHg.

Entity relations:
- Has_value("hepatic function", "Abnormal")
- Has_value("liver function test", "> twice the normal range")
- Has_value("renal function", "abnormal")
- Has_value("creatinine", "> 1.1 mg/dl")
- Has_value("fasting plasma glucose", "in the diabetic range")
- Subsumes("abnormal", "creatinine")
- Subsumes("in the diabetic range", ">/= 126 mg/dl")
- Has_value("blood pressure", "> 140/90 mmHg")
- OR("hepatic function", "renal function", "fasting plasma glucose", "blood pressure")